Clinical trial exclusion criterion:
Treatment with a medication that would prohibit the safe concurrent use of methylphenidate such as monoamine oxidase inhibitors and tricyclic antidepressants

Annotated entities:
- Drug: "medication that would prohibit the safe concurrent use of methylphenidate"
- Drug: "methylphenidate"
- Temporal: "concurrent"
- Observation: "prohibit"
- Drug: "monoamine oxidase inhibitors"
- Drug: "tricyclic antidepressants"